有關身體形象畏懼症（body dysmorphic disorder）的敘述，下列何者錯誤？
A. 以手術或醫學美容醫療介入可以有效地減緩病情
B. 患者對身體常見不滿意部位包含鼻子及頭髪
C. 常見的精神科共病包含重鬱症與強迫症
D. 藥物治療身體形象畏懼症以抗憂鬱劑治療為主

正確答案：A. 以手術或醫學美容醫療介入可以有效地減緩病情